Clinical trial exclusion criterion:
Patients taking immunosuppressant medication

Annotated entities:
- Procedure: "immunosuppressant medication"